Indicar, cuál de los compuestos relacionados a continuación, presenta una mayor acidez:
1. Ácido acético.
2. Bromuro de hidrógeno.
3. Ácido sulfúrico.
4. Ácido carbónico.
5. Ácido nítrico.

Respuesta correcta: 2. Bromuro de hidrógeno.